下列關於小兒麻痺病毒（poliovirus）之敘述，何者正確？
A. 分類上屬於小 RNA 病毒科（Picornaviridae），只有一種血清型
B. 其疫苗有去活性的（inactivated）沙賓疫苗，及減毒活性的（live attenuated）沙克疫苗
C. 感染後大部分人出現中樞神經症狀，少部分人為無症狀感染
D. 麻痺性脊髓灰白質炎（paralytic poliomyelitis）主要是因為此病毒感染脊髓前角細胞所致

正確答案：D. 麻痺性脊髓灰白質炎（paralytic poliomyelitis）主要是因為此病毒感染脊髓前角細胞所致